下列何種胺基酸，經由代謝程序，可成為甲基供給者（methyl donor）？
A. valine
B. threonine
C. methionine
D. glutamine

正確答案：C. methionine